Clinical trial exclusion criterion:
A glomerular filtration rate of 60 cc per minute or less.

Entity relations:
- Has_value("glomerular filtration rate", "60 cc per minute or less")